Clinical trial exclusion criterion:
Severe previous reaction or reaction considered immunological, such as anaphylaxis, facial swelling, severe rash, muscle ache with rise in serum creatine kinase, inflammatory myopathy, rhabdomyolysis or liver function abnormalities (aspartate transaminase (AST) or alanine transaminase (ALT) greater than 3 times upper limit or normal).

Annotated entities:
- Condition: "anaphylaxis"
- Condition: "facial swelling,"
- Condition: "severe rash"
- Condition: "muscle ache"
- Measurement: "serum creatine kinase"
- Value: "rise"
- Condition: "inflammatory myopathy"
- Condition: "rhabdomyolysis"
- Condition: "liver function abnormalities"
- Measurement: "aspartate transaminase"
- Measurement: "AST"
- Measurement: "alanine transaminase"
- Measurement: "ALT"
- Value: "greater than 3 times upper limit or normal"